頸椎退化性關節炎而導致脊髓病變，下列何者錯誤？
A. 會產生雙下肢緊而無力
B. 造成解尿困難
C. 會產生胸部以下麻木現象
D. 造成吞嚥困難

正確答案：D. 造成吞嚥困難